Clinical trial exclusion criterion:
presence of subacute or chronic DVT more than 21 days in duration, inability to lie in the prone position required for intervention, terminal systemic disease requiring palliative treatment, active bleeding (from a gastric/duodenal ulcer or the cerebrovascular system), a haemorrhagic stroke within the previous year, an impaired bleeding-clotting profile, and any haemophilic disorder, or pregnancy.

Entity relations:
- Has_qualifier("DVT", "subacute")
- Has_multiplier("DVT", "more than 21 days in duration")
- Has_mood("palliative treatment", "requiring")
- AND("terminal systemic disease", "palliative treatment")
- Has_qualifier("bleeding", "active")
- AND("bleeding", "gastric ulcer")
- Has_temporal("haemorrhagic stroke", "within the previous year")
- OR("subacute", "chronic")
- OR("gastric ulcer", "cerebrovascular system", "duodenal ulcer")
- OR("DVT", "pregnancy", "impaired bleeding-clotting profile", "haemorrhagic stroke", "bleeding", "terminal systemic disease", "inability to lie in the prone position", "haemophilic disorder")